Neoadjuvant chemotherapy for current malignancy

The above is a clinical trial exclusion criterion. Annotated with entity spans:
[Procedure: Neoadjuvant chemotherapy] for current [Condition: malignancy]